El mecanismo de una reacción química homogénea:
1. Puede incluir intermedios de reacción que no son ninguno de los reactivos ni ninguno de los productos.
2. Está completamente definido por la reacción química siempre que ésta refleje la estequiometria correcta de la reacción.
3. Sólo se define para reacciones complejas en las que los reactivos pasan por muchas etapas antes de convertirse en productos.
4. Es totalmente independiente de la ley de velocidad de la reacción.
5. No depende de la temperatura y es único para la reacción entre unos reactivos determinados.

Respuesta correcta: 1. Puede incluir intermedios de reacción que no son ninguno de los reactivos ni ninguno de los productos.